Clinical trial inclusion criterion:
Patients who have received no less than 20 transfusions of RBCs;

Annotated entities:
- Multiplier: "no less than 20"
- Procedure: "transfusions of RBCs"